mild (GOLD 1) or very severe COPD (GOLD 4)

The above is a clinical trial exclusion criterion. Annotated with entity spans:
[Qualifier: mild] ([Measurement: GOLD] [Value: 1)] or [Qualifier: very severe] [Condition: COPD] ([Measurement: GOLD] [Value: 4])